Clinical trial exclusion criterion:
Contraindication to prostaglandins according to current Parkland protocol

Entity relations:
- AND("Contraindication", "prostaglandins")
- AND("Contraindication", "Parkland protocol")